Clinical trial exclusion criteria:
(1) Uterine abnormalities (e.g. septate, bicornuate and fibroid uterus, Asherman Syndrome).
Concurrent use of organic nitrites and nitrates.
Severe hepatic impairment.
Severe renal impairment.
Hypotension.
Recent stroke or heart attack.

Annotated entities:
- Condition: "Uterine abnormalities"
- Condition: "septate uterus"
- Condition: "bicornuate uterus"
- Condition: "fibroid uterus"
- Condition: "Asherman Syndrome"
- Temporal: "Concurrent"
- Drug: "organic nitrites"
- Drug: "nitrates"
- Qualifier: "Severe"
- Condition: "hepatic impairment"
- Qualifier: "Severe"
- Condition: "renal impairment"
- Condition: "Hypotension"
- Condition: "stroke"
- Condition: "heart attack"
- Temporal: "Recent"